有關自然殺手細胞（natural killer cells）之敘述，下列何者錯誤？
A. 發源於共同淋巴先驅細胞（common lymphoid progenitor cell）
B. 具有毒殺顆粒（cytotoxic granules），釋放其中之物質以執行毒殺作用
C. 能毒殺不表現或低度表現第一型 MHC（MHC class I）分子之異常細胞
D. 其作用屬於適應性免疫力（adaptive immunity）

正確答案：D. 其作用屬於適應性免疫力（adaptive immunity）